Clinical trial exclusion criterion:
6. Hematocrit < 0.30

Annotated entities:
- Parsing_Error: "6."
- Measurement: "Hematocrit"
- Value: "< 0.30"